History of pancreatitis

The above is a clinical trial exclusion criterion. Annotated with entity spans:
[Temporal: History] of [Condition: pancreatitis]